Clinical trial inclusion criterion:
Absence of any sign of dementia/cognitive impairment in neuropsychological examinationsPatients for brain imaging:

Annotated entities:
- Condition: "dementia"
- Condition: "sign of dementia"
- Condition: "sign of cognitive impairment"
- Condition: "cognitive impairment"
- Negation: "Absence of"
- Procedure: "neuropsychological examinations"
- Parsing_Error: "Patients for brain imaging:"